Glycogen phosphorylase 可藉由磷酸化之共價修飾來活化，並將 glycogen 分解成 glucose-1-phosphate ，此磷酸化反應是經由何酵素進行？
A. phosphorylase kinase
B. phosphorylase phosphatase
C. trypsin
D. caspase

正確答案：A. phosphorylase kinase